Uncontrolled local or systemic diseases that affects wound healing (diabetes, autoimmune or inflammatory disorders)

The above is a clinical trial exclusion criterion. Annotated with entity spans:
[Qualifier: Uncontrolled] local or [Condition: systemic diseases] [Qualifier: that affects wound healing] ([Condition: diabetes], [Condition: autoimmune] or [Condition: inflammatory disorders])